¿Cuál de las siguientes intervenciones NO forma parte del entrenamiento en hábitos defecatorios para el tratamiento de la encorpresis?
1. La utilización de enemas para conseguir la desimpactación inicial y prevenir el estreñimiento.
2. El establecimiento de un momento determinado del día para llevar a cabo la defecación de modo regular.
3. El castigo positivo contingente a la defecación en lugares no apropiados (ropa interior).
4. Proporcionar restricciones y recomendaciones dietéticas.
5. El refuerzo por mantener las ropas limpias al final del día.

Respuesta correcta: 3. El castigo positivo contingente a la defecación en lugares no apropiados (ropa interior).